Clinical trial inclusion criterion:
age > 18 y.o.

Entity relations:
- Has_value("age", "> 18 y.o")